Es un patógeno intracelular obligado:
1. Neisseria gonorrhoeae.
2. Treponema pallidum
3. Chlamydia trachomatis.
4. Streptococcus pneumoniae.
5. Mycobacterium tuberculosis.

Respuesta correcta: 3. Chlamydia trachomatis.